當一位肺癌病人其頸部有淋巴結硬塊時，最適當的處置為何？
A. 以內視鏡切除肺腫瘤
B. 以內視鏡切除肺腫瘤加上縱隔淋巴結清掃
C. 以內視鏡切除肺腫瘤加上縱隔及頸部淋巴結清掃
D. 安排頸部淋巴結細針穿刺切片檢查

正確答案：D. 安排頸部淋巴結細針穿刺切片檢查